Clinical trial exclusion criterion:
Uncontrolled Heart Failure or NYHA Class III or IV heart failure

Entity relations:
- Has_qualifier("Heart Failure", "Uncontrolled")
- Has_qualifier("heart failure", "NYHA Class III")
- OR("NYHA Class III", "NYHA Class IV")
- OR("Heart Failure", "heart failure")